Where, in the body, would the Cobb-Stainsby excision arthroplasty be performed?

The Cobb-Stainsby forefoot arthroplasty combines partial phalangectomy (Stainsby) with extensor tendon transfer to the metatarsal head (Cobb).